迷走神經由下列何處進入腹腔？
A. 食道裂孔（esophageal hiatus）
B. 主動脈孔（aortic hiatus）
C. 腔靜脈孔（caval opening）
D. 正中弓狀韌帶（medial arcuate ligament）下

正確答案：A. 食道裂孔（esophageal hiatus）